17. Significant peripheral edema as per investigator's discretion

The above is a clinical trial exclusion criterion. Annotated with entity spans:
[Parsing_Error: 17.] [Qualifier: Significant] [Condition: peripheral edema] [Subjective_judgement: as per investigator's discretion]